Clinical trial exclusion criterion:
Patient with significant polymicrobial bacteraemia (that is, a Gram positive skin contaminant in one set of blood cultures is not regarded as significant polymicrobial bacteraemia).

Entity relations:
- Has_qualifier("bacteraemia", "polymicrobial")